List all reported treatment options for anxiety in autism spectrum disorder.

The predominant approach is to use versions of cognitive behavioural therapies, such as:
Mindfulness Based Therapy (MBT)
Multimodal Anxiety and Social Skills Intervention (MASSI) program
modified version of the Coping Cat program, (cognitive-behavioral therapy; CBT)
Family cognitive-behavioral therapy has been found to be more effective than Individual cognitive-behavioral therapy 
Conflict management for couples, even when conflict and family distress is low

Drugtherapy: 
Sertraline